What are the advantages of liquid biopsy in NSCLC?

Mutation analysis of circulating tumor cells (CTCs) may be desirable since they may provide real-time information on patient's disease status. Plasma-isolated exosomes can be used as a non-invasive and repeatable way for the detection and follow-up of these biomarkers. Liquid biopsy reflected spatial and temporal heterogeneity of the tumor under treatment pressure. Complementary use of ctDNA and ctcDNA represents a reliable, minimally invasive and dynamic tool for a more comprehensive view of tumor evolution.